A history of life-threatening asthma defined for this protocol as an asthma episode that required intubation, hypercapnea requiring non-invasive ventilatory support, respiratory arrest, hypoxic seizures or asthma-related syncopal episode(s).

The above is a clinical trial exclusion criterion. Annotated with entity spans:
A [Temporal: history] of [Qualifier: life-threatening] [Condition: asthma] defined for this protocol as an [Condition: asthma episode] that required [Procedure: intubation], [Condition: hypercapnea] requiring [Device: non-invasive ventilatory support], [Condition: respiratory arrest], [Condition: hypoxic seizures] or [Condition: asthma-related syncopal episode](s).